糖尿病腎絲球病變（diabetic glomerulopathy）進程中，不包括下列何者之變化？
A. 足細胞數增加
B. 足突消失（foot process effacement）
C. 腎絲球基底膜（glomerular basement membrane）結構破壞
D. 腎小球間質細胞（mesangial cells）形態改變

正確答案：A. 足細胞數增加